Diagnosis of DM type 2 with A1-C >7 to 15

The above is a clinical trial inclusion criterion. Annotated with entity spans:
Diagnosis of [Condition: DM type 2] with [Measurement: A1-C] [Value: >7 to 15]